Treating clinician deems infant eligible to receive 2-month vaccines

The above is a clinical trial inclusion criterion. Annotated with entity spans:
Treating clinician deems infant [Mood: eligible] to receive [Drug: 2-month vaccines]